Clinical trial exclusion criterion:
history of an invasive malignancy (other than this prostate cancer,or basal or squamous skin cancers) within prior 5 years

Annotated entities:
- Condition: "invasive malignancy"
- Negation: "other than"
- Condition: "prostate cancer"
- Condition: "squamous skin cancers"
- Condition: "basal skin cancers"
- Temporal: "within prior 5 years"